Clinical trial exclusion criterion:
Patients with a personal or family history of medullary thyroid carcinoma or patients with Multiple Endocrine Neoplasia syndrome type 2

Annotated entities:
- Temporal: "personal history"
- Observation: "family history"
- Condition: "medullary thyroid carcinoma"
- Condition: "Multiple Endocrine Neoplasia syndrome type 2"